Clinical trial inclusion criterion:
M3 (= 25%) marrow on day 15 OR meets SR criteria but M3 marrow on day 15 and *M1 marrow on day 33.

Annotated entities:
- Line: "M3 (= 25%) marrow on day 15 OR meets SR criteria but M3 marrow on day 15 and *M1 marrow on day 33"
- Condition: "M3 marrow"
- Value: "= 25%"
- Temporal: "on day 15"
- Measurement: "SR criteria"
- Value: "meets"
- Condition: "M3 marrow"
- Temporal: "on day 15"
- Condition: "M1 marrow"
- Temporal: "on day 33"